一位 48 歲男性，以前並無明顯的高血壓，他有長期喝酒的習慣，最近他逐漸出現呼吸困難及端坐呼吸的症狀，身體檢查血壓 118/72 mmHg，規則心跳 114/min，頸靜脈擴大，肺基部可聽到 rales，心臟可聽到 S3，胸部 X 光顯示心陰影有中等擴大，肺部輕微積水，心電圖為低電位以及左心房擴大，則最可能的診斷是：
A. 冠狀動脈心臟病
B. 心包囊積水症
C. 擴張型心肌症
D. 肥厚型心肌症

正確答案：C. 擴張型心肌症